What is the mechanism of action of idasanutlin?

Idasanutlin is a small-molecule inhibitor of MDM2, a negative regulator of tumor suppressor p53.